Clinical trial inclusion criterion:
American Society of Anesthesiology (ASA) Class I and II

Annotated entities:
- Measurement: "American Society of Anesthesiology (ASA) Class"
- Value: "I and II"